Clinical trial inclusion criterion:
Adequate organ function within 14 days of dosing

Entity relations:
- Has_index("within 14 days of dosing", "dosing")
- Has_temporal("Adequate organ function", "within 14 days of dosing")